History of previous surgery on the same knee

The above is a clinical trial exclusion criterion. Annotated with entity spans:
History of previous [Procedure: surgery] on the same [Qualifier: knee]